Clinical trial inclusion criterion:
1. Speak, read, and understand English or Spanish and is willing and able to provide written informed consent on an IRB-approved form prior to the initiation of any study procedures;

Annotated entities:
- Parsing_Error: "1."
- Non-query-able: "Speak, read, and understand English or Spanish and is willing and able to provide written informed consent on an IRB-approved form prior to the initiation of any study procedures;"